影響健康行為的因素中，如個人的屬性和人格特質等，無法用衛生教育改變的特性。這是屬於：
A. 不可改變之前置因素
B. 可改變之前置因素
C. 促成因素
D. 強化因素

正確答案：A. 不可改變之前置因素